Clinical trial exclusion criterion:
Patients with glaucoma.

Annotated entities:
- Condition: "glaucoma"